¿Cuál de los siguientes NO es un modo de adaptación en el Modelo de Adaptación de C. Roy?:
1. Modo fisiológico y físico.
2. Modo de autoconcepto.
3. Modo de función de rol.
4. Modo de dependencia.

Respuesta correcta: 4. Modo de dependencia.